Clinical trial inclusion criterion:
Subjects with a measured post-albuterol/salbutamol FEV1 >=50 and <=70% of predicted normal values calculated using NHANES III reference equations [Hankinson, 1999; Hankinson, 2010] at Screening (Visit 1).

Annotated entities:
- Qualifier: "post-albuterol/salbutamol"
- Temporal: "post-albuterol/salbutamol"
- Drug: "albuterol"
- Drug: "salbutamol"
- Reference_point: "albuterol/salbutamol"
- Measurement: "FEV1"
- Value: ">=50 and <=70% of predicted normal values"
- Qualifier: "using NHANES III reference equations"
- Temporal: "at Screening"
- Reference_point: "Screening"